No more than 72 hours has elapsed since the first positive blood culture collection.

The above is a clinical trial inclusion criterion. Annotated with entity spans:
[Temporal: No more than 72 hours] has elapsed since [Reference_point: the first positive blood culture collection].